Known cause of apnea other than apnea of prematurity

The above is a clinical trial exclusion criterion. Annotated with entity spans:
[Condition: Known cause of apnea] [Negation: other than] [Condition: apnea of prematurity]